正常成年人之肋骨緣（costal margin）是由下列第幾肋骨（rib）所構成？
A. 3～4
B. 5～6
C. 7～10
D. 11～12

正確答案：C. 7～10